Clinical trial inclusion criterion:
Males and females aged between 18 to 75 years.

Entity relations:
- Has_value("aged", "between 18 to 75 years")
- OR("Males", "females")